patients with chronic treatment with oral corticosteroids without stabilized pattern.

The above is a clinical trial exclusion criterion. Annotated with entity spans:
patients with chronic treatment with [Drug: oral corticosteroids] without stabilized pattern.